52歲女性，身高160公分，體重58公斤，主訴失眠、熱潮紅及焦慮，骨質密度掃描呈現骨質稀少（osteopenia），最近的一次月經為兩年前，之前沒有手術史或是內科病史。給與此病患荷爾蒙治療最適合的理由為下列何者？
A. 降低阿茲海默症之風險
B. 降低靜脈栓塞疾病之風險
C. 降低骨質疏鬆之風險
D. 降低子宮內膜癌之風險

正確答案：C. 降低骨質疏鬆之風險